下列何者為抑制 HIV 及預防 cytomegalovirus 感染的首選藥物？
A. Indinavir
B. Rifabutin
C. Fluconazole
D. Ganciclovir

正確答案：D. Ganciclovir